Clinical trial exclusion criterion:
Known allergic reactions to tenecteplase, clopidogrel, enoxaparin and aspirin

Entity relations:
- AND("allergic reactions", "tenecteplase")
- OR("tenecteplase", "enoxaparin", "clopidogrel", "aspirin")